Clinical trial exclusion criterion:
Spinal anesthesia or sciatic nerve block contraindicated

Annotated entities:
- Procedure: "Spinal anesthesia"
- Procedure: "sciatic nerve block"
- Condition: "contraindicated"